一位洗腎病人血液中的鉀離子6.2 mmol/L，心電圖中會觀察到下列何種現象？
A. tall T-waves
B. depressed T-waves and U-waves
C. ST-T elevation
D. QRS shortening

正確答案：A. tall T-waves